Clinical trial exclusion criterion:
Malignant cancer(s)

Annotated entities:
- Condition: "Malignant cancer"